Clinical trial inclusion criterion:
Male and female adolescent patients, aged 13 to 17 years, diagnosed with RLS based on the IRLSSG consensus criteria (Allen RP 2014) (Appendix 2).

Entity relations:
- Has_value("aged", "13 to 17 years")
- Subsumes("adolescent", "aged")
- AND("RLS", "IRLSSG consensus criteria")
- OR("Male", "female")